下列何者不是致病性普里昂蛋白（scrapie-like prion protein, PrPSC）的特性？
A. 致病潛伏期很長
B. 造成神經組織空洞化
C. 可存在於細胞外
D. 引起很強的免疫反應

正確答案：D. 引起很強的免疫反應